犬蛔蟲（Toxocara canis）最容易引起內臟幼蟲移行症（visceral larva migrans），其幼蟲最容易侵犯人體那一部位？
A. 腎臟
B. 肝臟
C. 腦部
D. 肺部

正確答案：B. 肝臟